Es espectroscopia de absorción molecular UVvisible se denomina punto isosbéstico a:
1. La región del espectro donde dos especies tienen la misma capacidad de emisión de radiación.
2. El pH al cual dos especies absorbentes tienen el mismo coeficiente de absorción molecular.
3. La temperatura a la cual dos especies absorbentes en equilibrio dejan de emitir radiación.
4. La longitud de onda a la cual dos especies absorbentes en equilibrio tiene el mismo índice de refracción.
5. La longitud de onda a la cual los coeficientes de absorción molecular de dos especies absorbentes en equilibrio, interconvertibles entre sí, son equivalentes.

Respuesta correcta: 5. La longitud de onda a la cual los coeficientes de absorción molecular de dos especies absorbentes en equilibrio, interconvertibles entre sí, son equivalentes.